Clinical trial exclusion criterion:
Active bleeding without control;

Entity relations:
- Has_qualifier("bleeding", "Active")